Clinical trial inclusion criterion:
Aged =18 years

Annotated entities:
- Person: "Aged"
- Value: "=18 years"